Alcoholic liver disease

The above is a clinical trial exclusion criterion. Annotated with entity spans:
[Condition: Alcoholic liver disease]